Clinical trial exclusion criterion:
3. Women with abnormally high liver enzymes or liver disease. (ALT or AST exceeding 2.0 x ULN AND total bilirubin exceeding 1.5 x ULN at screening and confirmed on repeat).

Entity relations:
- Has_value("liver enzymes", "high")
- Has_value("ALT", "exceeding 2.0 x ULN")
- Has_value("total bilirubin", "exceeding 1.5 x ULN")
- Has_index("at screening", "screening")
- Has_temporal("total bilirubin", "at screening")
- Has_temporal("ALT", "at screening")
- OR("liver enzymes", "liver disease")
- OR("ALT", "AST")